Which histone mark is recognized by HP1?

Histone H3 at lysine 9 (H3K9me3)